Clinical trial inclusion criterion:
Negative cardiac troponin test before the index elective PCI.

Annotated entities:
- Measurement: "cardiac troponin test"
- Value: "Negative"
- Temporal: "before the index elective PCI."
- Reference_point: "index elective PCI"
- Procedure: "PCI"